Active bleeding, bleeding diathesis.

The above is a clinical trial exclusion criterion. Annotated with entity spans:
[Qualifier: Active] [Condition: bleeding], [Condition: bleeding diathesis].